Clinical trial inclusion criterion:
HIV/HCV co-infected subjects (n=12) must also have a HIV RNA measurement <50 copies/mL at the pre-treatment visit.

Annotated entities:
- Condition: "HIV"
- Condition: "HCV"
- Condition: "co-infected"
- Measurement: "HIV RNA measurement"
- Value: "<50 copies/mL"
- Temporal: "at the pre-treatment visit"